A medical condition that could interfere with study participation

The above is a clinical trial exclusion criterion. Annotated with entity spans:
[Non-query-able: A medical condition that could interfere with study participation]